Clinical trial exclusion criterion:
Tuberculosis resistant to any of the study drugs (isoniazid, rifampin, EMB, PZA, CFZ, Pto)

Entity relations:
- Subsumes("study drugs", "isoniazid")
- AND("resistant to", "study drugs")
- Has_qualifier("Tuberculosis", "resistant to")
- OR("isoniazid", "CFZ", "PZA", "EMB", "rifampin", "Pto")